65歲男性患者二週前因急性心肌梗塞住院接受冠狀動脈支架置放後出院，今日因為胸痛與輕微發燒（37.8攝氏度）而回診。沒有呼吸窘迫，肺部聽診沒有囉音，心臟沒有出現新的雜 音、奔馬音（gallop）或心包摩擦音（friction rub）。初步檢查排除了感染情況，心電圖與出院之前做比較沒有變化。下列那一項治療較恰當？
A. 給予類固醇
B. 給予高劑量aspirin
C. 給予抗凝血劑（anticoagulant）
D. 加重狹心症藥品（antianginal drugs）

正確答案：B. 給予高劑量aspirin